下列有關內科疾病及其皮膚表徵的配對，何者最正確？
A. 腎衰竭（Renal insufficiency）：蜘蛛血管瘤（Spider angioma）
B. 紅斑性狼瘡（Lupus erythematosus）：脫髮症（alopecia）
C. 第二期梅毒（Secondary syphilis）：紅皮症（Erythroderma）
D. B 型肝炎（Hepatitis B infection）：黑色素沈著（Hyperpigmentation）

正確答案：B. 紅斑性狼瘡（Lupus erythematosus）：脫髮症（alopecia）